Clinical trial inclusion criterion:
Endoscopic Mayo subscore >0

Annotated entities:
- Measurement: "Endoscopic Mayo subscore"
- Value: ">0"